Clinical trial inclusion criterion:
Acute illness

Annotated entities:
- Condition: "Acute illness"